秀秀今年 28 歲，因為月經沒來，自己驗孕有懷孕，到婦產科門診求診時，主訴已懷孕過 3 次，但都早期就流產了，這次陰道超音波檢查有看到一個胚囊，大小約妊娠 7 週，有看到心跳，同時秀秀的子宮看起來懷疑是雙角子宮（bicornuate uterus），關於雙角子宮，下列敘述何者錯誤？
A. 雙角子宮是一種 Müllerian duct 發育的異常
B. 雙角子宮的流產（miscarriage）風險比分隔子宮（septate uterus）高
C. 雙角子宮生產時比較容易因為胎位不正而導致剖腹產
D. 雙角子宮如果一直反覆流產，建議先做子宮整形（metroplasty）再懷孕

正確答案：B. 雙角子宮的流產（miscarriage）風險比分隔子宮（septate uterus）高